women undergoing cesarean section at less than 37 weeks of gestation.

The above is a clinical trial exclusion criterion. Annotated with entity spans:
[Person: women] undergoing [Procedure: cesarean section] at [Temporal: less than 37 weeks] of [Measurement: gestation].